Clinical trial exclusion criterion:
History of intracranial haemorrhage

Annotated entities:
- Condition: "intracranial haemorrhage"
- Temporal: "History"